Clinical trial inclusion criterion:
subjects in good health upon medical history, physical exam, and laboratory testing in the opinion of the investigator

Annotated entities:
- Condition: "good health"
- Temporal: "medical history"
- Procedure: "physical exam"
- Procedure: "laboratory testing"